有關吸食強力膠的敘述，下列何者正確？
A. 若出現語無倫次與幻覺，可給予苯二氮平類（benzodiazepines）藥物控制症狀
B. 吸食強力膠有可能會產生耐受性（tolerance），但不常發生戒斷症狀
C. 長期使用會損及大腦與運動功能，但不影響智商
D. 大量使用也不致於有生命危險

正確答案：B. 吸食強力膠有可能會產生耐受性（tolerance），但不常發生戒斷症狀